Clinical trial inclusion criterion:
Diagnosis of diabetes mellitus according to World Health Organization criteria ( treatment with insulin or an oral hypoglycemic agent, twice random glucose measurements major than 200 mg/dl, or a fasting glucose major than 140 mg/dl)

Annotated entities:
- Condition: "diabetes mellitus"
- Qualifier: "World Health Organization criteria"
- Drug: "insulin"
- Procedure: "treatment"
- Drug: "oral hypoglycemic agent"
- Multiplier: "twice"
- Measurement: "random glucose measurements"
- Value: "major than 200 mg/dl"
- Measurement: "fasting glucose"
- Value: "major than 140 mg/dl"